Current use of other GLP-1A, dipeptidyl peptidase 4 (DPP4) or Sodium Glucose transporters 2 (SGLT2) inhibitors, thiazolidinediones (TZDs), pramlintide and fixed prandial insulin.

The above is a clinical trial exclusion criterion. Annotated with entity spans:
Current use of [Qualifier: other] [Drug: GLP-1A], [Drug: dipeptidyl peptidase 4 (DPP4)] or [Drug: Sodium Glucose transporters 2 (SGLT2) inhibitors], [Drug: thiazolidinediones (TZDs)], [Drug: pramlintide] and fixed [Drug: prandial insulin].